一位 70 歲的老婦人在整理自家花園時不慎被埋在土裡樹枝上的細刺扎到，當時不以為意，但一週後出現說話、吞嚥、呼吸困難等情形，且有胸痛，兩天後並發生頸部僵硬和呼吸衰竭，急送某醫學中心，醫師立即將她送入加護病房進行氣管切開並接上人工呼吸器。病人被診斷為破傷風（tetanus），下列何者是診斷此病最主要的依據？
A. 臨床症狀
B. 由血液中分離出破傷風菌
C. 在血液中偵測到破傷風毒素
D. 在由傷口取得的檢體中以顯微鏡觀察到破傷風菌

正確答案：A. 臨床症狀